Clinical trial inclusion criterion:
stroke

Annotated entities:
- Condition: "stroke"